白蛉（sandfly）可以媒介下列何種寄生蟲感染症？
A. 黑水熱（blackwater fever）
B. 斷骨熱（break-bone fever）
C. 黑熱病（kala-azar）
D. 黑死病（black death）

正確答案：C. 黑熱病（kala-azar）